La determinación de cianuro mediante el método de Liebig se basa en la adición de una disolución patrón de nitrato de plata:
1. Hasta precipitación completa del cianuro de plata.
2. Hasta que se inicia la precipitación del cianuro de plata.
3. Hasta la aparición de un precipitado rojo de cromato de plata.
4. Hasta que se forma cuantitativamente el complejo AgCN.
5. Hasta la precipitación de yoduro de plata, amarillo.

Respuesta correcta: 2. Hasta que se inicia la precipitación del cianuro de plata.